Clinical trial exclusion criterion:
-Female subjects should refrain from breastfeeding throughout this period.

Annotated entities:
- Person: "Female"
- Observation: "breastfeeding"
- Temporal: "throughout this period."
- Reference_point: "this period"
- Negation: "refrain from"